Systolic Blood Pressure < 80 mmHg / Mean arterial pressure < 50 mmHg on maximal support

The above is a clinical trial exclusion criterion. Annotated with entity spans:
[Measurement: Systolic Blood Pressure] [Value: < 80 mmHg] / [Measurement: Mean arterial pressure] [Value: < 50 mmHg] [Qualifier: on maximal support]